Clinical trial exclusion criterion:
Uncontrolled epilepsy (seizure within 6 months prior to consent)

Annotated entities:
- Condition: "Uncontrolled epilepsy"
- Value: "within 6 months prior to consent"
- Condition: "seizure"